Clinical trial exclusion criteria:
Affected by alcohol or drugs during the last month.
Untreated severe comorbid psychiatric or somatic illness.
Bloodpressure 150/95 or higher.
Irregular pulse, or pulse 100 or higher.
No counter indications according to the Medikinet pill.
Concurrent clinical diagnosis that significantly could affect test performance.
Concurrent prescription of medicines for ADHD or medicines that significantly could affect test performance.

Annotated entities:
- Observation: "alcohol"
- Observation: "drugs"
- Temporal: "last month"
- Condition: "illness psychiatric"
- Condition: "somatic illness"
- Qualifier: "Untreated"
- Qualifier: "severe"
- Qualifier: "comorbid"
- Measurement: "Bloodpressure"
- Value: "150/95 or higher"
- Measurement: "pulse"
- Value: "Irregular"
- Measurement: "pulse"
- Value: "100 or higher"
- Non-query-able: "No counter indications according to the Medikinet pill"
- Non-query-able: "Concurrent clinical diagnosis that significantly could affect test performance"
- Drug: "medicines"
- Condition: "ADHD"